History of immunodeficiency,

The above is a clinical trial exclusion criterion. Annotated with entity spans:
[Temporal: History] of [Condition: immunodeficiency],